women postmenopausal for 12 months before the study, surgically sterile, or not pregnant and on effective contraception.

The above is a clinical trial inclusion criterion. Annotated with entity spans:
[Pregnancy_considerations: women postmenopausal for 12 months before the study, surgically sterile, or not pregnant and on effective contraception.]